Clinical trial exclusion criterion:
Corneal disease potentially requiring a treatment during the following 3 months

Annotated entities:
- Condition: "Corneal disease"
- Procedure: "treatment"
- Mood: "potentially requiring"
- Temporal: "during the following 3 months"